關於類鼻疽（melioidosis）疾病，下列敘述何者正確？
A. 通常是由人與人互相傳播而造成感染
B. 病人在急性肺炎感染時，可以由血液或痰的培養來診斷疾病
C. 首選抗生素是cefazolin（第一代頭孢子素）
D. 使用有效的抗生素2週可治癒

正確答案：B. 病人在急性肺炎感染時，可以由血液或痰的培養來診斷疾病